Clinical trial exclusion criterion:
Hypersensitivity to bisoprolol or to any of the excipients.

Entity relations:
- Has_qualifier("excipients", "any")
- AND("Hypersensitivity", "bisoprolol")
- OR("bisoprolol", "excipients")